Clinical trial exclusion criterion:
Subjects who have received RBC transfusions cannot have >15% adult hemoglobin

Entity relations:
- Has_value("RBC transfusions", ">15% adult hemoglobin")
- Has_negation("RBC transfusions", "cannot have")